丘腦內側膝狀體（medial geniculate body of thalamus），主要投射至下列何處？
A. 顳橫迴（transverse temporal gyrus）
B. 外側枕顳迴（lateral occiptotemporal gyrus）
C. 島閾（limen insula）
D. 角迴（angular gyrus）

正確答案：A. 顳橫迴（transverse temporal gyrus）